Clinical trial exclusion criterion:
current or recent (within one week of surgery) systemic antibiotic use, intolerance to both clindamycin and cephalexin, discovery of a persistent cutaneous malignancy at the site of the defect following the reconstructive procedure and previous reconstruction at the site of the skin/soft-tissue defect.

Annotated entities:
- Drug: "antibiotic"
- Condition: "intolerance"
- Drug: "clindamycin"
- Drug: "cephalexin"
- Condition: "persistent cutaneous malignancy"
- Qualifier: "site of the defect"
- Temporal: "following the reconstructive procedure"
- Reference_point: "the reconstructive procedure"
- Procedure: "reconstructive procedure"
- Temporal: "within one week of surgery"
- Temporal: "recent"
- Temporal: "current"